人類的 Cloaca 在胚胎發育至第幾週時分化，且分裂成 Urogenital element and sphincter element 兩個部分？
A. 第 6 週
B. 第 8 週
C. 第 10 週
D. 第 12 週

正確答案：A. 第 6 週